Clinical trial inclusion criterion:
Over 18 years of age; Systemically healthy; Non-smoking;

Entity relations:
- Has_value("age", "Over 18 years")